Clinical trial exclusion criterion:
Acquired or congenital immunodeficiency;

Annotated entities:
- Condition: "Acquired immunodeficiency"
- Condition: "congenital immunodeficiency"